high blood pressure >180 systolic, 105, diastolic

The above is a clinical trial exclusion criterion. Annotated with entity spans:
high [Measurement: blood pressure] [Value: >180] systolic, [Value: 105], diastolic